Clinical trial inclusion criterion:
Interested in taking 3 months of varenicline

Annotated entities:
- Post-eligibility: "Interested in taking 3 months of varenicline"